Where is the protein "Single-stranded DNA-binding protein" found?

In the mitochondrion (mitochondrial single-stranded DNA binding protein, mtSSB) and its role is the regulation of mitochondrial DNA replication initiation in mammalian mitochondria.